Clinical trial exclusion criterion:
Women who received metallic fixation, coronary artery stent in recent 3 months; or women who received mechanical valve replacement that is not compatible with MR magnet; or women with aneurysmal clips, pacemakers.

Annotated entities:
- Person: "Women"
- Procedure: "metallic fixation"
- Device: "coronary artery stent"
- Temporal: "recent 3 months"
- Person: "women"
- Device: "mechanical valve replacement"
- Person: "women"
- Device: "aneurysmal clips"
- Device: "pacemakers"